神經阻斷術可用於麻醉與止痛作用，下列有關神經阻斷術的敘述，何者錯誤？
A. 神經位置的確定可用超音波、神經刺激器或依病人感覺
B. 病患不同意為絶對禁忌之一
C. 使用的局部麻醉藥不會造成全身毒性
D. 使用的針有可能傷到神經

正確答案：C. 使用的局部麻醉藥不會造成全身毒性